Clinical trial exclusion criterion:
Pregnancy (a negative serum or urine pregnancy test should be available for women of child-bearing potential before study inclusion) or lactation

Annotated entities:
- Pregnancy_considerations: "Pregnancy (a negative serum or urine pregnancy test should be available for women of child-bearing potential before study inclusion) or lactation"